anaphylaxis in the past six weeks,

The above is a clinical trial exclusion criterion. Annotated with entity spans:
[Condition: anaphylaxis] [Temporal: in the past six weeks],